Subjects who voluntarily consented, after listening enough explanation for this study and investigational product.

The above is a clinical trial inclusion criterion. Annotated with entity spans:
[Informed_consent: Subjects who voluntarily consented, after listening enough explanation for this study and investigational product.]